Clinical trial inclusion criterion:
No prior treatment with Ventavis or other active treatments for primary pulmonary hypertension within 6 weeks of date of study inclusion (unless otherwise advised by Bayer Schering Pharma)

Annotated entities:
- Procedure: "treatment with Ventavis"
- Condition: "primary pulmonary hypertension"
- Procedure: "treatments"
- Qualifier: "for primary pulmonary hypertension"
- Temporal: "within 6 weeks of date of study inclusion"
- Negation: "No"